Clinical trial inclusion criteria:
E.coli in blood culture
AND identical isolate in urine sample (>= 1.000 CFU) OR relevant clinical signs of UTI

Annotated entities:
- Procedure: "blood culture"
- Value: "E.coli"
- Value: "identical isolate"
- Procedure: "urine sample"
- Measurement: "CFU"
- Value: ">= 1.000"
- Mood: "clinical signs"
- Condition: "UTI"